myocardial infarction

The above is a clinical trial exclusion criterion. Annotated with entity spans:
[Condition: myocardial infarction]